Clinical trial inclusion criteria:
Patient harboring a GRE or CRE bacteria
Colonization confirmed by our microbiology department, including at least 3 positives swabs in the last month

Annotated entities:
- Condition: "CRE bacteria"
- Condition: "GRE bacteria"
- Multiplier: "at least 3"
- Value: "positives"
- Procedure: "swabs"
- Temporal: "in the last mont"
- Condition: "Colonization"
- Qualifier: "confirmed by our microbiology department"